下列何者是右側結腸癌常見的症狀？
A. 腹瀉（Diarrhea）
B. 貧血（Anemia）
C. 腸阻塞（Intestinal obstruction）
D. 鮮血便（Bright bloody stool）

正確答案：B. 貧血（Anemia）